Signed informed consent either from the patient, their legally authorized representative or a direct family member

The above is a clinical trial inclusion criterion. Annotated with entity spans:
[Informed_consent: Signed informed consent either from the patient, their legally authorized representative or a direct family member]